Subject has stool positive for ova and parasite and for Clostridium difficule toxins within 3 months prior to enrollment.

The above is a clinical trial exclusion criterion. Annotated with entity spans:
Subject has [Measurement: stool] [Value: positive for ova] and [Value: parasite] and for [Value: Clostridium difficule toxins] [Temporal: within 3 months prior] to [Reference_point: enrollment].